over 18 years

The above is a clinical trial inclusion criterion. Annotated with entity spans:
[Value: over 18 years]